Clinical trial exclusion criteria:
Respiratory exacerbation within the 2 months preceding the study
Current diagnostic of asthma
Significant O2 desaturation (SpO2 < 85%) at rest or during exercise
Presence of another pathology that could influence exercise tolerance
Use of home oxygen

Annotated entities:
- Condition: "Respiratory exacerbation"
- Temporal: "within the 2 months preceding the study"
- Reference_point: "the study"
- Temporal: "Current"
- Condition: "diagnostic of asthma"
- Qualifier: "Significant"
- Condition: "O2 desaturation"
- Measurement: "SpO2"
- Value: "< 85%"
- Qualifier: "at rest"
- Qualifier: "during exercise"
- Qualifier: "another"
- Condition: "pathology"
- Qualifier: "influence exercise tolerance"
- Procedure: "home oxygen"